若想探討三種牛奶品牌與出生季節對嬰兒體重的影響，那一種統計方法較適合？
A. 一方變異數分析（one-way ANOVA）
B. 二方變異數分析（two-way ANOVA）
C. 三方變異數分析（three-way ANOVA）
D. 重複測量變異數分析（repeated measurement ANOVA）

正確答案：B. 二方變異數分析（two-way ANOVA）